Clinical trial inclusion criterion:
Gleason score = 7 (3+4 and/or 4+3) and/or

Entity relations:
- Subsumes("= 7", "3+4")
- Has_value("Gleason score", "3+4")
- OR("3+4", "4+3")